Clinical trial inclusion criterion:
IAP between 12 and 20 mmHg in at least two consecutive measurements within 1-12 h

Annotated entities:
- Measurement: "IAP"
- Value: "between 12 and 20 mmHg"
- Multiplier: "at least two consecutive measurements"
- Temporal: "within 1-12 h"